Use of a fibrinolytic agent, surgical thrombectomy, interventional (catheter-directed) thrombus aspiration or lysis, or use of a cava filter to treat the index episode of PE

The above is a clinical trial exclusion criterion. Annotated with entity spans:
Use of a [Drug: fibrinolytic agent], [Procedure: surgical thrombectomy,] interventional (catheter-directed) [Procedure: thrombus aspiration] or lysis, or use of a [Procedure: cava filter] to treat the index episode of [Condition: PE]